Which syndromes are caused by LAMA1 mutations?

Poretti-Boltshauser and Joubert syndromes